Child-Pugh classification 把肝硬化病人肝功能狀況分為三級，下列何者不屬於其評分項目？
A. Bilirubin
B. Albumin
C. Prothrombin time
D. ICG test（Indocyanine Green test）

正確答案：D. ICG test（Indocyanine Green test）